刺激淚腺（lacrimal gland）分泌的副交感節後神經纖維（parasympathetic postganglionic fibers）源自於下列何者？
A. 睫狀神經節（ciliary ganglion）
B. 膝神經節（geniculate ganglion）
C. 翼腭神經節（pterygopalatine ganglion）
D. 耳神經節（otic ganglion）

正確答案：C. 翼腭神經節（pterygopalatine ganglion）